Known serious hypersensitivity to other parenteral iron products

The above is a clinical trial exclusion criterion. Annotated with entity spans:
Known [Qualifier: serious] [Condition: hypersensitivity] to other [Drug: parenteral iron products]